20歲女性，過去兩周持續性的低度發燒。病人兩側臉頰出現紅斑，口腔有一無痛性潰瘍。尿液出現紅血球圓柱（erythrocyte  casts）。血液中抗細胞核抗體（antinuclear antibody）、抗雙股去氧核醣核酸抗體（anti-double stranded DNA antibody）、抗史密斯抗原（anti-Smith antigen）抗體、類風濕因子（rheumatoid factor）呈陽性反應；抗染色體中節抗體（anticentromere antibody）、抗Scl-70抗體，抗SS-A抗體、抗SS-B抗體等則呈現陰性反應。此疾病主要的致病機轉，與引起下列何種疾病的免疫過度反應（hypersensitivity）最接近？
A. 多發性硬化症（multiple sclerosis）
B. 急性風濕熱（acute rheumatic fever）
C. 鏈球菌感染後腎絲球腎炎（poststreptococcal glomerulonephritis）
D. 重症肌無力（myasthenia gravis）

正確答案：C. 鏈球菌感染後腎絲球腎炎（poststreptococcal glomerulonephritis）